Clinical trial inclusion criterion:
7. Each volunteer must have acceptable medical history, physical examination and laboratory test

Annotated entities:
- Parsing_Error: "7."
- Temporal: "medical history"
- Procedure: "physical examination"
- Measurement: "laboratory test"
- Undefined_semantics: "medical history, physical examination and laboratory test"
- Post-eligibility: "Each volunteer must have acceptable medical history, physical examination and laboratory test"